有關譫妄（delirium）之敘述，何者錯誤？
A. 譫妄之發作為急性發作
B. 譫妄之記憶障礙通常主要發生在遠期記憶，較少有近期記憶及立即記憶之障礙
C. 譫妄之注意力會有波動性之變化
D. 譫妄在警覺性（alertness）方面會有過度警覺或降低警覺性

正確答案：B. 譫妄之記憶障礙通常主要發生在遠期記憶，較少有近期記憶及立即記憶之障礙